Clinical trial inclusion criterion:
Be on a stable regimen of antiparkinson's medications at least 30 days prior to screening, and be expected to remain on a stable dose for the duration of the study.

Entity relations:
- Has_index("at least 30 days prior to screening", "screening")
- Has_temporal("antiparkinson's medications", "at least 30 days prior to screening")